Clinical trial exclusion criterion:
15. Pregnant or nursing patients

Annotated entities:
- Parsing_Error: "15."
- Condition: "Pregnant"
- Condition: "nursing"